下列何者不會發生於正常心周期（cardiac cycle）的心室舒張期（diastole）？
A. 半月瓣（semilunar valves）開啟
B. 房室瓣（atrioventricular valves）開啟
C. 心室充血（ventricular filling）
D. 心房收縮（atrial contraction）

正確答案：A. 半月瓣（semilunar valves）開啟